頸部受傷的病人接受頸部探查手術的適應症，下列何者錯誤？
A. 頸部血腫一直擴大
B. 頸部出現皮下氣腫
C. 喘鳴（stridor）
D. 脈搏增快

正確答案：D. 脈搏增快